Any major illness (Liver disease, Renal failure, Heart disease, Cancer, etc)

The above is a clinical trial exclusion criterion. Annotated with entity spans:
Any [Condition: major illness] ([Condition: Liver disease], [Condition: Renal failure], [Condition: Heart disease], [Condition: Cancer], etc)